Pregnant or nursing woman.

The above is a clinical trial exclusion criterion. Annotated with entity spans:
[Condition: Pregnant] or [Condition: nursing] [Person: woman].